Clinical trial exclusion criterion:
1. Prior Therapy Exposure to chemotherapy or radiotherapy within 2 weeks prior to entering the study or those who have not recovered from adverse events due to agents administered more than 2 weeks earlier. Systemic steroids that have not been stabilized (≥ 5 days) to the equivalent of ≤10 mg/day prednisone prior to the start of the study drugs. No other investigational agents are allowed.

Entity relations:
- Has_index("within 2 weeks prior", "entering the study")
- Has_temporal("chemotherapy", "Prior")
- Has_temporal("chemotherapy", "within 2 weeks prior")
- Has_negation("recovered", "not")
- AND("adverse events", "recovered")
- Has_temporal("agents", "more than 2 weeks earlier")
- AND("adverse events", "agents")
- Has_negation("stabilized", "not")
- Has_temporal("stabilized", "≥ 5 days")
- Has_qualifier("Systemic steroids", "stabilized")
- Has_multiplier("prednisone", "≤10 mg/day")
- AND("stabilized", "prednisone")
- Has_index("prior to", "start of the study drugs")
- Has_temporal("stabilized", "prior to")
- OR("chemotherapy", "radiotherapy")
- OR("chemotherapy", "adverse events")